Life expectancy < 6 months.

The above is a clinical trial exclusion criterion. Annotated with entity spans:
[Observation: Life expectancy] [Value: < 6 months].